Clinical trial inclusion criterion:
Clinical laboratory values as specified in the study protocol

Annotated entities:
- Non-query-able: "Clinical laboratory values as specified in the study protocol"